Clinical trial exclusion criterion:
heavily calcified vessels

Annotated entities:
- Condition: "heavily calcified vessels"